在評估病患的免疫能力時，發現病患的免疫球蛋白濃度只有同年齡人平均值的五分之一。為了瞭解病患血液白血球中 B 細胞的百分比是否正常，應該採用何種方法來檢查？
A. 將羊紅血球與病患紅血球混和後檢查血球凝集
B. 用帶螢光的抗人類免疫球蛋白抗體處理病患白血球後以流式細胞儀偵測
C. 將白血球以抗 CD3 刺激後觀察細胞分裂
D. 用 Epstein-Barr 病毒刺激白血球後觀察細胞分裂

正確答案：B. 用帶螢光的抗人類免疫球蛋白抗體處理病患白血球後以流式細胞儀偵測